下列何者位於骨骼肌內，主要功能是貯存鈣離子，以控制肌肉收縮？
A. 肌漿網（sarcoplasmic reticulum）
B. 粗糙內質網（rough endoplasmic reticulum） -
C. 高基氏體（Golgi apparatus）
D. 溶酶體（lysosome）

正確答案：A. 肌漿網（sarcoplasmic reticulum）